Stable psychiatric medications and doses for the month prior to enrollment. Subjects may continue to engage in any ongoing psychotherapy.

The above is a clinical trial inclusion criterion. Annotated with entity spans:
[Qualifier: Stable] [Drug: psychiatric medications] and doses [Temporal: for the month prior to enrollment]. [Non-representable: Subjects may continue to engage in any ongoing psychotherapy.]